一位 40 歲男性為潰瘍性結腸炎（ulcerative colitis）的患者，最近 1 個月出現皮膚癢、膚色變黃等現象。肝臟切片發現膽小管周圍有發炎細胞浸潤，膽小管周圍有纖維組織包圍呈現洋蔥皮樣的排列 （onion-skin fibrosis），抗粒線體抗體（anti-mitochondrial antibody）呈現陰性反應，則下列何者為最可能之診斷？
A. 原發性硬化性膽管炎（primary sclerosing cholangitis）
B. 原發性膽道硬化症（primary biliary cirrhosis）
C. 先天性肝臟纖維化（congenital hepatic fibrosis）
D. 肝內結石（intrahepatic cholelithiasis）

正確答案：A. 原發性硬化性膽管炎（primary sclerosing cholangitis）